Clinical trial exclusion criterion:
Active drug or alcohol use or dependence that, in the opinion of the site investigator, would interfere with adherence to study requirements.

Annotated entities:
- Condition: "alcohol use or dependence"
- Condition: "drug use or dependence"
- Temporal: "Active"